Clinical trial inclusion criterion:
Antiretroviral naive

Entity relations:
- AND("naive", "Antiretroviral")